History of corneal transplantation or recent intraocular surgery

The above is a clinical trial exclusion criterion. Annotated with entity spans:
History of [Procedure: corneal transplantation] or recent [Procedure: intraocular surgery]